腎元分為表淺腎元（superficial nephron）與近髓質腎元（juxtamedullary nephron），下列腎小管那一個部分不屬於表淺腎元？
A. 近端腎小管（proximal tubule）
B. 亨氏管細上升支（thin ascending limb of Henle's loop）
C. 亨氏管粗上升支（thick ascending limb of Henle's loop）
D. 收集管（connecting tubule）

正確答案：B. 亨氏管細上升支（thin ascending limb of Henle's loop）